En la técnica de análisis por inyección en flujo:
1. Se inyecta un volumen relativamente grande de muestra en el sistema, obteniéndose señales en estado estacionario.
2. Se introduce un pequeño volumen de muestra cuya integridad se mantiene por segmentación con burbujas de aire.
3. La muestra mantiene su integridad durante todo el proceso ya que se dispone en contenedores separados.
4. Las respuestas obtenidas tienen forma de pico cuya altura depende de la concentración de la muestra.
5. La principal dificultad se encuentra en la lentitud de las medidas.

Respuesta correcta: 4. Las respuestas obtenidas tienen forma de pico cuya altura depende de la concentración de la muestra.